下列關於威爾遜氏病（Wilson disease）治療的敘述，何者正確？
A. D-penicillamine 最常見副作用是會產生多發性神經病變（polyneuropathy）
B. 在整個療程中，飲食可以不必忌諱高含銅食物
C. 所有的病人都會在開始治療後惡化
D. 若因 D-penicillamine 副作用而無法服用的患者可改用 trientine

正確答案：D. 若因 D-penicillamine 副作用而無法服用的患者可改用 trientine